Previous intolerance to kava

The above is a clinical trial inclusion criterion. Annotated with entity spans:
[Temporal: Previous] [Condition: intolerance] to [Drug: kava]